Emergent re intervention

The above is a clinical trial exclusion criterion. Annotated with entity spans:
[Qualifier: Emergent] [Procedure: re intervention]